Clinical trial inclusion criterion:
Patients with 2 or more interproximal sites (not on same tooth) with probing pocket depths of 5mm or more and 2 or more interproximal sites (not on same tooth)of probing attachment loss of 4mm or more which bled on probing.

Entity relations:
- Has_multiplier("interproximal sites of probing attachment loss of 4mm or more", "2 or more")
- Has_qualifier("interproximal sites of probing attachment loss of 4mm or more", "bled on probing")
- Has_multiplier("interproximal sites with probing pocket depths of 5mm or more", "2 or more")